Clinical trial inclusion criterion:
Pregnant

Annotated entities:
- Condition: "Pregnant"